Clinical trial exclusion criterion:
Previous CABG

Annotated entities:
- Procedure: "CABG"